Clinical trial exclusion criterion:
History of head injury, seizures, or stroke

Annotated entities:
- Condition: "head injury"
- Condition: "seizures"
- Condition: "stroke"
- Temporal: "History"